age under 18y or over 85y

The above is a clinical trial exclusion criterion. Annotated with entity spans:
[Person: age] [Value: under 18y or over 85y]